Clinical trial exclusion criterion:
History of previous cesarean delivery

Annotated entities:
- Temporal: "History"
- Temporal: "previous"
- Procedure: "cesarean delivery"